Clinical trial inclusion criterion:
Visual analog score pain >= 5

Annotated entities:
- Measurement: "Visual analog score pain"
- Value: ">= 5"